Clinical trial exclusion criterion:
Participating in a competing study

Annotated entities:
- Non-query-able: "Participating in a competing study"